Clinical trial inclusion criterion:
Age = 18 years of either gender

Entity relations:
- Has_value("Age", "= 18 years")